Clinical trial exclusion criterion:
Unwillingness or inability to cooperate, or for the parents or guardians to give consent, or for the child to give assent, or any condition of sufficient severity to impair cooperation in the study

Annotated entities:
- Observation: "Unwillingness to cooperate"
- Observation: "inability to cooperate"
- Observation: "Unwillingness for the parents to give consent"
- Observation: "inability for the parents to give consent"
- Observation: "Unwillingness for the guardians to give consent"
- Observation: "inability for the guardians to give consent"